The diagnosis of mild-severe acute exacerbation of chronic bronchitis (AECB)

The above is a clinical trial inclusion criterion. Annotated with entity spans:
The diagnosis of [Qualifier: mild-severe] [Qualifier: acute] [Condition: exacerbation of chronic bronchitis] ([Condition: AECB])